Clinical trial exclusion criterion:
A self-reported history of loss of consciousness (greater than 10 minutes)

Entity relations:
- Has_value("history of loss of consciousness", "greater than 10 minutes")
- Has_qualifier("history of loss of consciousness", "self-reported")